Which gene is the paralog of yeast UPC2?

the related transcription factors Ecm22 and Upc2 play a crucial role in Saccharomyces cerevisiae filamentation.